Any significant acute or chronic medical illness or problem, including, but not limited to, diabetes, hypertension, cardiac disease, asthma, chronic obstructive lung disease

The above is a clinical trial exclusion criterion. Annotated with entity spans:
Any significant [Qualifier: acute] or [Qualifier: chronic] [Condition: medical illness] or problem, including, but not limited to, [Condition: diabetes], [Condition: hypertension], [Condition: cardiac disease], [Condition: asthma], [Condition: chronic obstructive lung disease]